Clinical trial exclusion criterion:
History of alcohol abuse (defined as average intake of three or more units of alcohol per day) within 5 years of the Screening Visit.

Annotated entities:
- Condition: "alcohol abuse"
- Temporal: "History"
- Multiplier: "three or more units per day"
- Drug: "alcohol"
- Temporal: "within 5 years of the Screening Visit"
- Reference_point: "the Screening Visit"